Claustrophobic patient unable to undergo the examination

The above is a clinical trial exclusion criterion. Annotated with entity spans:
[Condition: Claustrophobic] patient [Negation: unable] to undergo the [Procedure: examination]